Clinical trial exclusion criterion:
Clinically significant illness during the 4 weeks prior to the first dose administration

Entity relations:
- Has_index("during the 4 weeks prior to the first dose administration", "the first dose administration")
- Has_qualifier("illness", "Clinically significant")
- Has_temporal("illness", "during the 4 weeks prior to the first dose administration")